醫師判讀一項檢查結果時必須知道該檢查的敏感度（sensitivity）。何謂敏感度？
A. 檢查結果為陽性的病人中，確實有該項疾病的機率
B. 檢查結果為陰性的病人中，確實沒有該項疾病的機率
C. 有該項疾病的病人中，檢查結果為陽性的機率
D. 沒有該項疾病的病人中，檢查結果為陰性的機率

正確答案：C. 有該項疾病的病人中，檢查結果為陽性的機率